Be medically stable.

The above is a clinical trial inclusion criterion. Annotated with entity spans:
Be [Condition: medically stable].